Clinical trial inclusion criterion:
Performance status 0-2 (Appendix B) may include patients with performance status > 2 attributable to LAL.

Entity relations:
- Has_value("Performance status", "0-2")